¿Cuántos pares de nervios raquídeos están conectados a la médula espinal?
1. Veintiocho.
2. Veintinueve.
3. Treinta y un.
4. Treinta y tres.
5. Treinta y cinco.

Respuesta correcta: 3. Treinta y un.